Clinical trial inclusion criterion:
2. Patients undergoing primary or subsequent deceased-donor or living donor kidney transplantation.

Entity relations:
- Has_multiplier("deceased-donor kidney transplantation", "primary")
- OR("deceased-donor kidney transplantation", "living donor kidney transplantation")
- OR("primary", "subsequent")